Immunosuppressive therapy before 6 months of study initiation

The above is a clinical trial exclusion criterion. Annotated with entity spans:
[Procedure: Immunosuppressive therapy] [Temporal: before 6 months of study initiation]